下列那一個病例較符合所列之動脈血氣體分析和血清電解質的檢查結果？pH 7.32，PaO2 110 mmHg， PaCO2 30 mmHg，HCO3- 18 mEq/L；Na+ 138，K+ 3.5，Cl- 97（電解質的單位是 mmol/L）
A. 70 歲病人因便秘嚴重，服用 magnesium sulfate 導致腹瀉數天
B. 28 歲病人診斷為修格連氏症候群（Sjögren's syndrome），無意間發現腎鈣化（nephrocalcinosis），尿液酸鹼值為 6.5；給予 NH4Cl（0.1 g/kg 體重）後，尿液酸鹼值為 6.0
C. 20 歲病人第一型糖尿病病史 5 年，血糖控制不佳，最近因為期末考胰島素注射次數減少
D. 60 歲病人因膽道阻塞放置引流管引流膽汁

正確答案：C. 20 歲病人第一型糖尿病病史 5 年，血糖控制不佳，最近因為期末考胰島素注射次數減少